Clinical trial exclusion criterion:
Obesity defined as BMI>30

Annotated entities:
- Measurement: "BMI"
- Condition: "Obesity"
- Value: ">30"